En la regulación del metabolismo del glucógeno por la adrenalina:
1. Se inhibe la adenilato ciclasa.
2. Se inhibe la protenína kinasa A a través del AMPc.
3. La glucógeno sintetasa se inhibe por fosforilación.
4. La glucógeno fosforilasa se inhibe por fosforilación.
5. La principal enzima que la lleva a cabo es la proteína kinasa C.

Respuesta correcta: 3. La glucógeno sintetasa se inhibe por fosforilación.